Clinical trial exclusion criterion:
Clinical evidence of a severe Personality Disorder, as assessed by the study psychiatrist, which would impede participation or completion of the trial.

Annotated entities:
- Qualifier: "severe"
- Condition: "Personality Disorder"